¿Qué tipo de actividad enzimática presenta la primasa en la replicación del DNA?:
1. RNA polimerasa.
2. Helicasa.
3. DNA polimerasa.
4. RNA ligasa.
5. DNA ligasa.

Respuesta correcta: 1. RNA polimerasa.